下列有關上泌尿道移形上皮細胞癌的敘述，何者錯誤？
A. 85%之腎盂腫瘤為乳突狀
B. 50~60%之腎盂腫瘤為表淺性
C. 55~75%之輸尿管腫瘤為低分化及早期之腫瘤
D. 上、中、下段輸尿管腫瘤之比率分別為 5%、25%、70%

正確答案：B. 50~60%之腎盂腫瘤為表淺性